Clinical trial inclusion criterion:
Expected duration of hospital stay and time on steroids >= 3 days

Entity relations:
- Has_value("time on steroids", ">= 3 days")
- Has_value("Expected duration of hospital stay", ">= 3 days")